En la replicación de los genes eucariotas participa:
1. Las proteínas Dna A y Dna B.
2. El complejo de seis proteínas denominado ORC.
3. El complejo de ocho proteínas denominado metilasa Dam.
4. El complejo de MutL-MutS.
5. El complejo de MutH.

Respuesta correcta: 2. El complejo de seis proteínas denominado ORC.